provided written informed consent

The above is a clinical trial inclusion criterion. Annotated with entity spans:
[Informed_consent: provided written informed consent]